Clinical trial exclusion criterion:
History of penetrating keratoplasty.

Entity relations:
- Has_temporal("penetrating keratoplasty", "History")